下列有關 X-linked lymphoproliferative syndrome 的情況，何者正確？
A. 是因 Toll like receptor 2（TLR2）基因之缺陷所引起
B. 亦同時併有血小板凝血機能之障礙
C. T 細胞之活化有缺陷，病人易因 Epstein-Barr virus（EBV）之感染而死亡
D. 會引起 IFNγ receptor 1 及 IFNγ receptor 2 的功能低下，因此易有細胞內細菌如 Mycobacterium avium 之感染

正確答案：C. T 細胞之活化有缺陷，病人易因 Epstein-Barr virus（EBV）之感染而死亡